Clinical trial exclusion criterion:
Acute or chronic clinically significant gastrointestinal disease

Entity relations:
- Has_qualifier("gastrointestinal disease", "clinically significant")
- Has_qualifier("gastrointestinal disease", "Acute")
- OR("Acute", "chronic")